Clinical trial exclusion criterion:
Evidence of the acquisition of HCV at the time of or after transplantation

Annotated entities:
- Condition: "acquisition of HCV"
- Temporal: "at the time of or after transplantation"
- Reference_point: "transplantation"